1. Neoadjuvant treatment prior to radiation therapy or radical prostatectomy, provided that the total duration of exposure does not exceed 10 months.

The above is a clinical trial inclusion criterion. Annotated with entity spans:
1. [Procedure: Neoadjuvant treatment] [Temporal: prior to radiation therapy or radical prostatectomy], provided that the [Measurement: total duration of exposure] [Value: does not exceed 10 months].